Clinical trial inclusion criteria:
obtained consent
singleton pregnancy
subarachnoid anaesthesia

Annotated entities:
- Non-query-able: "obtained consent"
- Condition: "pregnancy"
- Qualifier: "singleton"
- Procedure: "subarachnoid anaesthesia"